Clinical trial inclusion criterion:
heart failure NYHA II-IV

Entity relations:
- Has_value("NYHA", "II-IV")
- AND("heart failure", "NYHA")